Concomitant antiplatelet or anticoagulant use

The above is a clinical trial exclusion criterion. Annotated with entity spans:
[Temporal: Concomitant] [Drug: antiplatelet] or [Drug: anticoagulant] use